在正常情況下，astrocyte不具下列何種功能？
A. 血腦障壁之形成
B. 形成myelin
C. 調節細胞外液之離子濃度
D. 協助提供葡萄糖給神經元

正確答案：B. 形成myelin